Clinical trial exclusion criterion:
Evidence or history of clinically significant allergic reactions to varenicline

Entity relations:
- AND("allergic", "varenicline")